Presence of other haemodynamically significant obstructive lesions of the LV outflow tract, including aortic and subaortic stenosis.

The above is a clinical trial exclusion criterion. Annotated with entity spans:
Presence of other [Qualifier: haemodynamically significant] [Condition: obstructive lesions] of the [Qualifier: LV outflow tract], including [Condition: aortic] and [Condition: subaortic stenosis].